Clinical trial exclusion criterion:
preexisting cognitive deficits, dementia, or delirium

Entity relations:
- OR("cognitive deficits", "dementia", "delirium")